Clinical trial inclusion criterion:
persistent HbA1c levels = 7.5% (58 mmol/mol) despite optimized education therapy,

Entity relations:
- Has_multiplier("HbA1c levels", "persistent")
- Subsumes("= 7.5%", "58 mmol/mol")
- Has_value("HbA1c levels", "= 7.5%")
- AND("HbA1c levels", "optimized education therapy")